關於嬰兒猝死症候群（sudden infant death syndrome , SIDS）的敘述，下列何者錯誤？
A. SIDS定義為一歲以下嬰兒突然死亡，且經過完整病理解剖、解析死亡過程並檢視臨床病史等詳細調查後，仍未能找到死因者
B. 發生率在一個月以下的新生兒達高峰，其次在2-3個月大時，也很常見
C. 危險因子包括胎兒在子宮內暴露吸菸、早產、未哺育母乳、趴睡、與父母共眠、嬰兒床有鬆軟物品
D. 研究發現SIDS也可與基因變異有關，例如心肌之鈉鉀通道、自律神經系統發展、呼吸控制中樞等之基因異常

正確答案：B. 發生率在一個月以下的新生兒達高峰，其次在2-3個月大時，也很常見